History of ischaemic heart disease, cardiac failure, cerebrovascular disease, liver impairment (ALT/AST>50IU/L) or stage 3-5 chronic kidney disease.

The above is a clinical trial exclusion criterion. Annotated with entity spans:
History of [Condition: ischaemic heart disease], [Condition: cardiac failure], [Condition: cerebrovascular disease], [Condition: liver impairment] ([Measurement: ALT]/[Measurement: AST][Value: >50IU/L]) or [Measurement: stage] [Value: 3-5] [Condition: chronic kidney disease].